Clinical trial exclusion criterion:
hypertensive disorders of pregnancy

Annotated entities:
- Condition: "hypertensive disorders of pregnancy"